Subjects must have the ability to understand and the willingness to sign a written informed consent document.

The above is a clinical trial inclusion criterion. Annotated with entity spans:
[Non-query-able: Subjects must have the ability to understand and the willingness to sign a written informed consent document].